Clinical trial exclusion criterion:
Documented positive hepatitis B (HBV) surface antigen, and/or HBV DNA prior to enrollment

Annotated entities:
- Measurement: "hepatitis B surface antigen"
- Value: "positive"
- Measurement: "HBV DNA"
- Temporal: "prior to enrollment"
- Reference_point: "enrollment"